Clinical trial inclusion criterion:
Clinical and radiographic evidence of FAI

Annotated entities:
- Condition: "FAI"
- Qualifier: "radiographic evidence"
- Qualifier: "Clinical evidence"